Current known infection with human immunodeficiency virus (HIV), active hepatitis B and/or hepatitis C virus.

The above is a clinical trial exclusion criterion. Annotated with entity spans:
[Temporal: Current] known infection with [Condition: human immunodeficiency virus (HIV)], active [Condition: hepatitis B] and/or [Condition: hepatitis C virus].